與年輕人相比，老年人罹患肺炎時的相關症狀，下列敘述何者正確？
A. 發燒的比例比年輕人高
B. 咳嗽有痰的比例比年輕人高
C. 產生心智功能障礙的比例比年輕人高
D. 產生胸痛的比例比年輕人高

正確答案：C. 產生心智功能障礙的比例比年輕人高